Clinical trial exclusion criterion:
Contraindications to magnetic resonance imaging (MRI).

Annotated entities:
- Procedure: "magnetic resonance imaging (MRI)"
- Condition: "Contraindications"